Clinical trial inclusion criterion:
Be an experienced opioid user, defined as any subject treated with opioid therapy, equivalent or equal to >20 mg per day of morphine, for a period of 3 consecutive days immediately prior to first day of dosing.

Annotated entities:
- Drug: "opioid therapy"
- Drug: "morphine"
- Multiplier: ">20 mg per day"
- Qualifier: "equivalent"
- Drug: "morphine"
- Temporal: "3 consecutive days immediately prior to first day of dosing"
- Reference_point: "first day of dosing"